疼痛控制是癌末病人症狀處理的首要，下列有關疼痛控制的敘述，何者錯誤？
A. 疼痛控制不佳來自醫師缺乏疼痛控制的教育訓練所致
B. 病人常因害怕嗎啡上癮而忍耐疼痛，沒有真實反應疼痛程度
C. 依據世界衛生組織階梯式的止痛原則，對輕度和中度的疼痛先使用非嗎啡的止痛藥物
D. 嗎啡類的止痛劑，對神經病變性疼痛比身體或內臟性疼痛有效

正確答案：D. 嗎啡類的止痛劑，對神經病變性疼痛比身體或內臟性疼痛有效